Clinical trial exclusion criterion:
concomitant treatments with medication known to have drug interactions with dronabinol, such as, central nervous system depressants (barbiturates, benzodiazepines, buspirone, lithium, etc) and anticholinergic agents (atropine, scopolamine, antihistamines, etc).

Entity relations:
- Subsumes("central nervous system depressants", "barbiturates")
- Subsumes("anticholinergic agents", "atropine")
- AND("drug interactions", "dronabinol")
- AND("medication", "drug interactions")
- AND("treatments", "medication")
- Subsumes("medication", "central nervous system depressants")
- OR("barbiturates", "buspirone", "benzodiazepines", "lithium")
- OR("atropine", "scopolamine", "antihistamines")
- OR("central nervous system depressants", "anticholinergic agents")